Clinical trial exclusion criterion:
Any of gangrene, osteomyelitis, cellulitis, or Charcot osteoarthropathy.

Annotated entities:
- Condition: "gangrene"
- Multiplier: "Any of"
- Condition: "osteomyelitis"
- Condition: "cellulitis"
- Condition: "Charcot osteoarthropathy"